Clinical trial exclusion criterion:
Died before TAVI

Annotated entities:
- Observation: "Died"
- Temporal: "before TAVI"